下列有關神經性休克（neurogenic shock ）之敘述，何者錯誤？
A. 低血壓
B. 心跳慢
C. 周邊血管灌流變差
D. 可使用α agonist治療

正確答案：C. 周邊血管灌流變差